Inability to undergo MRI with gadolinium administration

The above is a clinical trial exclusion criterion. Annotated with entity spans:
[Condition: Inability to undergo MRI] with [Drug: gadolinium] administration